兒童的氣管插管，可用下列那一公式估算插管內徑？
A. 2 - (patient's age in years)/2
B. 3 + (patient's age in years)/5
C. 4 + (patient's age in years)/4
D. (patient's age in years) + 2

正確答案：C. 4 + (patient's age in years)/4